Untreated thyrotoxicosis.

The above is a clinical trial exclusion criterion. Annotated with entity spans:
[Qualifier: Untreated] [Condition: thyrotoxicosis].